El orden de las etapas del ciclo celular es:
1. S, G1, Mitosis, G2.
2. G2, G1, S, Mitosis.
3. G1, Mitosis, G2, S.
4. S, G0, Mitosis, G1.
5. G1, S, G2, Mitosis.

Respuesta correcta: 5. G1, S, G2, Mitosis.